一位病人因體重減輕而來就診，適當之初步檢驗（initial testing）不包括下列何者？
A. 全血球計數（CBC）（complete blood count）
B. 肝功能生化檢查
C. 上消化道內視鏡
D. 胸部 X 光檢查

正確答案：C. 上消化道內視鏡